Clinical trial exclusion criterion:
regular herbal medicine or antioxidant supplementation.

Annotated entities:
- Drug: "antioxidant supplementation"
- Procedure: "herbal medicine"